CURB65 score is used for stratification of which disease?

CURB65 (confusion, urea, respiration, blood pressure; age>65 years) is used for assessment of pneumonia severity.